Clinical trial exclusion criterion:
Hemidiaphragmatic dysfunction, suspected or known PNP

Annotated entities:
- Condition: "Hemidiaphragmatic dysfunction"
- Condition: "PNP"
- Qualifier: "known"
- Qualifier: "suspected"